Subject agreed to follow the protocol

The above is a clinical trial inclusion criterion. Annotated with entity spans:
[Informed_consent: Subject agreed to follow the protocol]